下列有關 Kanagawa hemolysin 之敘述，何者錯誤？
A. 由 Vibrio parahaemolyticus 所分泌
B. 是一種對熱穩定的毒素
C. 在羊血培養基呈 β 溶血現象
D. 會導致水瀉（watery diarrhea）

正確答案：C. 在羊血培養基呈 β 溶血現象